frequent urinary tract infections

The above is a clinical trial exclusion criterion. Annotated with entity spans:
[Multiplier: frequent] [Condition: urinary tract infections]